921 大地震時，大樓倒塌，一位 46 歲男性被崩塌的混凝土壓到軀幹與下肢，經過一日一夜之搶救終於送往急診，在急診發現右側脛骨及腓骨骨折，因此接受跟骨鋼釘牽引術，為避免因橫紋肌溶解而造成急性腎衰竭，病人轉往加護病房嚴密觀察、並評估接受血液透析之必要，6 個小時後，病人感到右側小腿非常疼痛，當護士扳動腳趾時，疼痛感更形加劇，下一步應採取之最佳步驟是下列何者？
A. 立刻安排右側脛骨及腓骨骨折固定手術，以免造成次發傷害
B. 立刻安排手術做筋膜切開術
C. 立刻給與止痛劑（例如嗎啡），以免因為疼痛、血壓升高而產生併發症
D. 立刻將鋼釘牽引改成骨髓內釘固定，以利於復健計畫執行

正確答案：B. 立刻安排手術做筋膜切開術